Subjects not able to give informed consent

The above is a clinical trial exclusion criterion. Annotated with entity spans:
Subjects [Negation: not] [Mood: able to] [Informed_consent: give informed consent]